下列何者不傳遞鼻腔黏膜的感覺訊息？
A. 篩前神經（anterior ethmoidal nerve）
B. 腭小神經（lesser palatine nerve）
C. 鼻腭神經（nasopalatine nerve）
D. 腭大神經（greater palatine nerve）

正確答案：B. 腭小神經（lesser palatine nerve）